Clinical trial exclusion criterion:
Treatment with a medication that would prohibit the safe concurrent use of methylphenidate such as monoamine oxidase inhibitors and tricyclic antidepressants

Entity relations:
- Has_temporal("methylphenidate", "concurrent")
- Has_context("methylphenidate", "prohibit")
- Subsumes("medication that would prohibit the safe concurrent use of methylphenidate", "monoamine oxidase inhibitors")
- OR("monoamine oxidase inhibitors", "tricyclic antidepressants")